一位 45 歲男性末期腎病患者選擇腹膜透析（peritoneal dialysis），下列敘述何者錯誤？
A. 每兩天執行一次腹膜透析
B. 腹膜透析單次注入腹腔 2 公升透析液是可以的
C. 腹膜透析脫水靠滲透壓（osmolality），最常用來提供滲透壓的物質是高濃度葡萄糖
D. 肌酸酐廓清率每週 70 L 是足夠的

正確答案：A. 每兩天執行一次腹膜透析